Clinical trial exclusion criterion:
Pregnant women

Annotated entities:
- Condition: "Pregnant"
- Person: "women"